Thalassemia syndromes;

The above is a clinical trial exclusion criterion. Annotated with entity spans:
[Condition: Thalassemia syndromes];